non-English speaking

The above is a clinical trial exclusion criterion. Annotated with entity spans:
[Negation: non]-[Observation: English speaking]